病人因聲音沙啞（hoarseness）而到耳鼻喉科就診，經檢查發現右側聲帶（vocal cord）無法外展，其病因最不可能為：
A. 鎖骨（clavicle）附近穿刺傷
B. 甲狀腺惡性腫瘤
C. 惡性腫瘤轉移所引起之中縱隔腔（middle mediastinum）淋巴結腫大
D. 甲狀腺手術之後遺症

正確答案：C. 惡性腫瘤轉移所引起之中縱隔腔（middle mediastinum）淋巴結腫大